Clinical trial inclusion criterion:
fetus in cephalic presentation

Annotated entities:
- Condition: "cephalic presentatio"